下列何者為治療succinylcholine引起的惡性高溫（malignant hyperthermia）最適當的藥物？
A. dantrolene
B. baclofen
C. rocuronium
D. diazepam

正確答案：A. dantrolene